Clinical trial exclusion criterion:
History of bleeding diathesis or known coagulopathy (including heparin-induced thrombocytopenia), or refuses blood transfusions.

Entity relations:
- Has_temporal("bleeding diathesis", "History")
- Subsumes("coagulopathy", "heparin-induced thrombocytopenia")
- multi("refuses blood transfusions", "blood transfusions")
- OR("bleeding diathesis", "coagulopathy", "refuses blood transfusions")